Clinical trial inclusion criterion:
Age 18-80 years old;

Annotated entities:
- Person: "Age"
- Value: "18-80 years old"